Pulseless extremity

The above is a clinical trial exclusion criterion. Annotated with entity spans:
[Condition: Pulseless extremity]